Clinical trial exclusion criterion:
Patient with a chronic pain condition, major unexpected surgical complication, unexpected prolonged intubation, patient refusal, local anesthetic allergy, any contraindication to regional anesthesia, greater than 2 attempts by resident and greater than 1 attempt by staff anesthesiologist for TAP block.

Annotated entities:
- Condition: "chronic pain condition"
- Qualifier: "major"
- Condition: "unexpected surgical complication"
- Multiplier: "prolonged"
- Procedure: "intubation"
- Qualifier: "unexpected"
- Observation: "patient refusal"
- Drug: "local anesthetic"
- Condition: "allergy"
- Condition: "contraindication"
- Drug: "regional anesthesia"
- Multiplier: "greater than 2"
- Multiplier: "greater than 1"
- Procedure: "TAP block"
- Person: "resident"
- Person: "anesthesiologist"